¿Cuál de los siguientes fármacos empleados en el tratamiento de la osteoporosis actúa mediante unión al ligando del RANK?
1. Alendronato.
2. Denosumab.
3. Calcitonina.
4. Raloxifeno.
5. Teriparatida.

Respuesta correcta: 2. Denosumab.